Clinical trial inclusion criterion:
Baseline 6-minutes walking distance 150m-550m.

Annotated entities:
- Measurement: "6-minutes walking distance"
- Value: "150m-550m"
- Temporal: "Baseline"